Clinical trial exclusion criterion:
Intellectual Disability

Annotated entities:
- Condition: "Intellectual Disability"